Clinical trial exclusion criteria:
women undergoing caesarean section at less than 37 weeks of gestation.
Hypertension with pregnancy.
Cardiac and coronary diseases with pregnancy

Annotated entities:
- Person: "women"
- Procedure: "caesarean section"
- Temporal: "undergoing"
- Value: "less than 37 weeks"
- Measurement: "gestation"
- Condition: "Hypertension"
- Condition: "pregnancy"
- Condition: "coronary diseases"
- Condition: "Cardiac diseases"
- Condition: "pregnancy"